30歲已婚女性，因為男性因素不孕症的原因，接受試管嬰兒療程（in vitro fertilization）。接受超音波導引取卵手術的隔天，因為噁心、腹漲、呼吸喘等不適回到醫院，診斷是卵巢過度刺激症候群（ovarian hyperstimulation syndrome）。下列何項作法可以降低這項疾病的發生機會？
A. 增加療程中gonadotropin的劑量
B. 選用GnRH agonist誘發排卵（ovulation trigger）接	冷凍胚胎（cryopreservation）於下次植入
C. 選用GnRH agonist的長療程（long protocol）
D. 於取卵後的黃體期支持（luteal support）中施打human chorionic gonadotropin（hCG）

正確答案：B. 選用GnRH agonist誘發排卵（ovulation trigger）接	冷凍胚胎（cryopreservation）於下次植入